Clinical trial exclusion criteria:
Subjects taking any lipid modification therapy, including but not limited to statins, fibrates and bile acid sequestrants.
Subjects taking fish oil or any other supplements, which in the investigator s opinion may interfere with the study.
Subjects with acute liver disease or active peptic ulcer disease.
Subjects with elevated uric acid levels greater than 10 mg/dL or gout
Pregnancy or women currently breastfeeding.
Female subjects taking hormonal contraceptives or hormone replacement therapy may be included in this study only if they have been on a stable dose for at least 3 months.
BMI less than 18.5
Subjects with weight that varies greater than 20% over the past 3 months.
Subjects taking the following medications for at least six weeks, which may interfere with the study, will be excluded: BAS, antibiotics, anticoagulants, anticonvulsants, antiarrhythmic, Cyclosporine, Mycophenolate and Synthroid. Subjects with chronic diarrhea, gastric bypass or lap band procedures, ostomies, bowel motility problems, or other conditions that could affect intestinal fat absorption.
Subjects initiating new medications or patients on multiple medications may also be excluded.
Inability to swallow capsules
Patients with a history of type I or type II diabetes or HbA1c greater than 6.5%.
Volunteers may also be excluded, if in the opinion of the study investigators, they have some other condition or disorder that may adversely affect the outcome of the study or the safety of the volunteer.

Annotated entities:
- Procedure: "lipid modification therapy"
- Drug: "statins"
- Drug: "fibrates"
- Drug: "bile acid sequestrants"
- Grammar_Error: "and"
- Drug: "fish oil"
- Subjective_judgement: "Subjects taking fish oil or any other supplements, which in the investigator s opinion may interfere with the study."
- Post-eligibility: "Subjects taking fish oil or any other supplements, which in the investigator s opinion may interfere with the study."
- Condition: "acute liver disease"
- Condition: "peptic ulcer disease"
- Temporal: "active"
- Measurement: "uric acid levels"
- Value: "elevated"
- Value: "greater than 10 mg/dL"
- Condition: "gout"
- Condition: "Pregnancy"
- Person: "women"
- Observation: "breastfeeding"
- Person: "Female"
- Drug: "hormonal contraceptives"
- Procedure: "hormone replacement therapy"
- Qualifier: "stable dose"
- Temporal: "for at least 3 months"
- Grammar_Error: "may be included"
- Measurement: "BMI"
- Value: "less than 18.5"
- Measurement: "weight"
- Qualifier: "varies greater than 20%"
- Temporal: "over the past 3 months"
- Temporal: "for at least six weeks"
- Drug: "BAS"
- Drug: "antibiotics"
- Drug: "anticoagulants"
- Drug: "anticonvulsants"
- Drug: "antiarrhythmic"
- Drug: "Cyclosporine"
- Drug: "Mycophenolate"
- Drug: "Synthroid"
- Grammar_Error: "and"
- Condition: "chronic diarrhea"
- Procedure: "gastric bypass"
- Procedure: "lap band procedures"
- Procedure: "ostomies"
- Condition: "bowel motility problems"
- Condition: "conditions that could affect intestinal fat absorption"
- Undefined_semantics: "conditions that could affect intestinal fat absorption"
- Non-query-able: "Subjects initiating new medications or patients on multiple medications may also be excluded."
- Condition: "Inability to swallow capsules"
- Condition: "type II diabetes"
- Condition: "type I diabetes"
- Measurement: "HbA1c"
- Value: "greater than 6.5%"
- Temporal: "history"
- Non-query-able: "Volunteers may also be excluded, if in the opinion of the study investigators, they have some other condition or disorder that may adversely affect the outcome of the study or the safety of the volunteer."
- Subjective_judgement: "Volunteers may also be excluded, if in the opinion of the study investigators, they have some other condition or disorder that may adversely affect the outcome of the study or the safety of the volunteer."
- Post-eligibility: "Volunteers may also be excluded, if in the opinion of the study investigators, they have some other condition or disorder that may adversely affect the outcome of the study or the safety of the volunteer."